10. Presence of an active systemic or local cancer or tumor of any kind (with the exception of non-melanoma skin cancer)

The above is a clinical trial exclusion criterion. Annotated with entity spans:
[Parsing_Error: 10.] Presence of an [Temporal: active] [Condition: systemic] or [Condition: local cancer] or [Condition: tumor of any kind] ([Negation: with the exception of] [Condition: non-melanoma skin cancer])